一位 50 歲男性病患被送入急診處，家人主訴病患在冬天早晨起床作運動時突然倒地，意識喪失，並且四肢不斷抽搐。由家中送至急診時間約有 30 分鐘，該現象一直持續。則第一步應：
A. 給予 Valium 10 mg 靜脈注射
B. 給予 Ativan 2 mg 靜脈注射
C. 給予 Dormicum 5 mg 靜脈注射
D. 清除呼吸道分泌物並考慮建立氣管內插管

正確答案：D. 清除呼吸道分泌物並考慮建立氣管內插管